Informed consent to participate in the study (ICF signed)

The above is a clinical trial inclusion criterion. Annotated with entity spans:
[Post-eligibility: Informed consent to participate in the study (ICF signed)]